Which gene is primarily associated with the Saethre-Chotzen syndrome?

It is caused by cytogenetic deletions or mutations of the TWIST1 gene.